Clinical trial exclusion criterion:
Previous treatment with the ketogenic diet

Annotated entities:
- Procedure: "ketogenic diet"
- Qualifier: "Previous"